Los monosacáridos son los hidratos de carbono más sencillos, están constituidos por una sola unidad de polihidroxialdehído, uno de ellos es:
1. La sacarosa.
2. La glucosa.
3. La lactosa.
4. El almidón.

Respuesta correcta: 2. La glucosa.